Clinical trial inclusion criterion:
Global Initiative for Chronic Obstructive Lung Disease (GOLD) 0: FEV1=0.80 and FEV1/FVC>0.70 Forced Expiratory Volume in 1 second (FEV1), Forced Vital Capacity (FVC)

Annotated entities:
- Measurement: "Global Initiative for Chronic Obstructive Lung Disease (GOLD)"
- Value: "0"
- Measurement: "FEV1"
- Value: "=0.80"
- Measurement: "FEV1/FVC"
- Value: ">0.70"
- Non-representable: "Forced Expiratory Volume in 1 second (FEV1), Forced Vital Capacity (FVC)"